6. Coronary vessels with tortuosity or extremely calcified

The above is a clinical trial exclusion criterion. Annotated with entity spans:
[Parsing_Error: 6.] [Condition: Coronary vessel]s with tortuosity or extremely calcified